一個外觀不規則多囊狀的腎臟，切片檢查發現有 undifferentiated mesenchyme、cartilage、immature collecting duct，請問這是何種腎臟疾病？
A. Cystic renal dysplasia
B. Autosomal-dominant polycystic kidney disease
C. Autosomal-recessive polycystic kidney disease
D. Medullary sponge kidney

正確答案：A. Cystic renal dysplasia